Clinical trial exclusion criterion:
comorbid psychotic, bipolar, substance use dependence, Alzheimer's or dementia

Entity relations:
- Has_temporal("psychotic", "comorbid")
- OR("psychotic", "Alzheimer's", "substance use dependence", "bipolar", "dementia")